Clinical trial exclusion criterion:
Prior surgery at the index lumbar level.

Annotated entities:
- Procedure: "surgery"
- Qualifier: "index lumbar level"
- Temporal: "Prior"